Clinical trial inclusion criterion:
Not attempting to conceive either at the time of study entry or for at least 2 years after surgery

Annotated entities:
- Mood: "attempting"
- Procedure: "conceive"
- Temporal: "at the time of study entry"
- Temporal: "for at least 2 years after surgery"
- Negation: "Not"